血塊造成腦部血管栓塞（embolism），此血塊最不可能來自下列何者？
A. 上腔靜脈（superior vena cava）
B. 右肺靜脈（right pulmonary vein）
C. 左心室（left ventricle）
D. 左心房（left atrium）

正確答案：A. 上腔靜脈（superior vena cava）